oocyte donation cycles

The above is a clinical trial exclusion criterion. Annotated with entity spans:
[Procedure: oocyte donation cycles]